Clinical trial exclusion criterion:
Suspected or documented tuberculosis involving the central nervous system and/or bones and/or joints, and/or miliary tuberculosis and/or pericardial tuberculosis.

Annotated entities:
- Condition: "tuberculosis"
- Qualifier: "central nervous system"
- Qualifier: "bones"
- Qualifier: "joints"
- Qualifier: "miliary tuberculosis"
- Qualifier: "pericardial tuberculosis"
- Mood: "documented"
- Mood: "Suspected"